¿En qué procesos actúa la lipoproteína lipasa?:
1. En la hidrólisis de triacilgliceroles a partir de las lipoproteínas plasmáticas para proporcionar ácidos grasos a los tejidos.
2. En la captación intestinal de las grasas de la dieta.
3. En la rotura intracelular de lipoproteínas.
4. En la hidrólisis de lipoproteínas para proporcionar aminoácidos.

Respuesta correcta: 1. En la hidrólisis de triacilgliceroles a partir de las lipoproteínas plasmáticas para proporcionar ácidos grasos a los tejidos.